¿Cuál de las siguientes afirmaciones es FALSA con respecto al mieloma múltiple?
1. Son datos importantes para el pronóstico la citogenética y los niveles séricos de albúmina y beta2-microglobulina.
2. El bortezomib, la talidomida, la lenalidomida y la poliquimoterapia son herramientas terapéuticas muy útiles.
3. El trasplante autogénico de progenitores hematopoyéticos proporciona una larga supervivencia libre de progresión.
4. El trasplante alogénico se debe considerar un procedimiento experimental (de eficacia no probada).
5. La radioterapia no tiene ningún papel en el tratamiento de la enfermedad o sus complicaciones.

Respuesta correcta: 5. La radioterapia no tiene ningún papel en el tratamiento de la enfermedad o sus complicaciones.